新生兒的 Mongolian spot，最主要是下列何者所造成？
A. epidermal melanin
B. epidermal melanocyte
C. dermal melanin
D. dermal melanocyte

正確答案：D. dermal melanocyte